Clinical trial exclusion criterion:
Parkinson's disease with hallucinations

Annotated entities:
- Condition: "Parkinson's disease"
- Condition: "hallucinations"